Clinical trial exclusion criterion:
Intraretinal edema on OCT;

Entity relations:
- AND("OCT", "Intraretinal edema")